Clinical trial inclusion criterion:
4. Can maintain oral food intake during the study

Annotated entities:
- Non-query-able: "Can maintain oral food intake during the study"